Clinical trial exclusion criterion:
Inability to follow the procedures of the study, e.g. due to language problems, psychological disorders, dementia of the study subject

Annotated entities:
- Post-eligibility: "Inability to follow the procedures of the study, e.g. due to language problems, psychological disorders, dementia of the study subject"